一位 15 歲女生輕度發燒及頭痛，電腦斷層掃描發現左額葉有個腦膿瘍，無外傷，住院後 2 個星期死亡。下列有關該病變的敘述，何者正確？
A. 來源最可能是額竇炎
B. 來源最可能是中耳炎
C. 周邊部位莢膜以反應性星狀細胞為主
D. 中央區域是凝固壞死

正確答案：A. 來源最可能是額竇炎